Clinical trial exclusion criterion:
previous intolerance to moderate altitude (<2600m).

Annotated entities:
- Condition: "intolerance"
- Observation: "altitude"
- Qualifier: "moderate"
- Value: "<2600m"